有關顯微手術的目的，下列敘述何者錯誤？
A. 為了轉移遠處的組織（distant tissue）到組織缺損的部位來做重建
B. 為了修補血管之傷害或缺損（vascular injury or vascular defects）
C. 可修補周圍神經（peripheral nerves）
D. 顯微手術通常是用來修補小面積的組織缺損

正確答案：D. 顯微手術通常是用來修補小面積的組織缺損